Clinical trial exclusion criterion:
Coagulation disturbances not normalized by medical treatment

Entity relations:
- Has_negation("normalized", "not")
- AND("normalized", "medical treatment")
- Has_qualifier("Coagulation disturbances", "normalized")